Patients with a life expectancy of greater than 1 year

The above is a clinical trial inclusion criterion. Annotated with entity spans:
Patients with a [Observation: life expectancy] of [Value: greater than 1 year]